王先生自東南亞出差回台第二天因突然開始的大量腹瀉被送醫診治，從他的排泄物中培養出霍亂弧菌（Vibrio cholerae）。此格蘭氏陰性病菌會產出霍亂毒素（cholera toxin）蛋白，造成腸上皮細胞中 adenylyl cyclase 的持續性活化，使水分及一些離子被分泌至腸腔中而導致無痛性水瀉。下列關於 cholera toxin 致病機轉之敘述何者正確？
A. cholera toxin 催化 Gs 蛋白（stimulatory G protein）α 次單元（αs）之 ADP-ribosylation
B. cholera toxin 造成 Gs 蛋白 αs 次單元之 GTPase 活性持續活化
C. cholera toxin 使 Gs 蛋白 αs 次單元無法與 βγ 次單元分開
D. cholera toxin 造成 Gs 蛋白 αs 次單元無法維繫於細胞膜上

正確答案：A. cholera toxin 催化 Gs 蛋白（stimulatory G protein）α 次單元（αs）之 ADP-ribosylation